Planned administration of a vaccine not foreseen by the study protocol up to 30 days after the second vaccination with H5N1 vaccine.

The above is a clinical trial exclusion criterion. Annotated with entity spans:
Planned administration of a [Drug: vaccine] [Negation: not] [Qualifier: foreseen by the study protocol] [Temporal: up to 30 days] after the [Value: second] [Drug: vaccination] with [Drug: H5N1 vaccine].